訊息傳遞之去敏感化（desensitization）在腎上腺素（epinephrine）的例子是經由？
A. 對腎上腺素受體進行磷酸化
B. 對腎上腺素受體進行去磷酸化
C. 開放鉀離子通道
D. 開放鈉離子通道

正確答案：A. 對腎上腺素受體進行磷酸化